Clinical trial exclusion criterion:
renal disease, as glomerular filtration rate (GFR) <60 ml/min/1,73 m*m

Annotated entities:
- Condition: "renal disease"
- Measurement: "glomerular filtration rate"
- Measurement: "GFR"
- Value: "<60 ml/min/1,73 m*m"